Clinical trial exclusion criterion:
Subjects with weight that varies greater than 20% over the past 3 months.

Annotated entities:
- Measurement: "weight"
- Qualifier: "varies greater than 20%"
- Temporal: "over the past 3 months"